Severe co-morbid illness such as untreatable other malignancy and/or active infections.

The above is a clinical trial exclusion criterion. Annotated with entity spans:
[Qualifier: Severe] [Condition: co-morbid illness] such as [Qualifier: untreatable] [Qualifier: other] [Condition: malignancy] and/or [Qualifier: active] [Condition: infections].